關於庫欣氏病（Cushing's disease）三項內分泌測試結果：①1 mg dexamethasone 抑制試驗 ②2 mg  dexamethasone 抑制試驗 ③8 mg dexamethasone 抑制試驗 下列那一個選項的敘述正確？
A. ①②③皆抑制
B. ①②抑制③不抑制
C. ①②不抑制③抑制
D. ①②③皆不抑制

正確答案：C. ①②不抑制③抑制